Clinical trial exclusion criterion:
Uncontrolled intercurrent or chronic illness

Annotated entities:
- Condition: "intercurrent illness"
- Condition: "chronic illness"
- Qualifier: "Uncontrolled"